Women stimulated with Syntocinon® infusion for induction of labour (with or without cervical priming by prostaglandin)

The above is a clinical trial inclusion criterion. Annotated with entity spans:
[Person: Women] stimulated with [Procedure: Syntocinon® infusion] for [Procedure: induction of labour] (with or without [Procedure: cervical priming] by [Drug: prostaglandin])